Habitualmente la capacitación de los espermatozoides se produce en:
1. Los túbulos seminíferos.
2. El epidídimo.
3. La uretra masculina.
4. La vagina.
5. El útero.

Respuesta correcta: 5. El útero.